Clinical trial exclusion criterion:
Subject has stool positive for ova and parasite and for Clostridium difficule toxins within 3 months prior to enrollment.

Entity relations:
- Has_value("stool", "positive for ova")
- Has_value("stool", "parasite positive for")
- Has_value("stool", "Clostridium difficule toxins positive for")
- Has_index("within 3 months prior", "enrollment")
- Has_temporal("stool", "within 3 months prior")